Clinical trial exclusion criterion:
Subjects under the age of 21.

Entity relations:
- Has_value("age", "under the age of 21")